Children who are wards of the state, in foster care or police custody or detention will be excluded.

The above is a clinical trial exclusion criterion. Annotated with entity spans:
Children who are [Observation: wards of the state], in [Observation: foster care] or [Observation: police custody] or [Observation: detention] will be excluded.